1. Currently enrolled in another research trial for investigative nutritional or other therapies thought to have an impact on immune system functioning.

The above is a clinical trial exclusion criterion. Annotated with entity spans:
1. [Subjective_judgement: Currently enrolled in another research trial for investigative nutritional or other therapies thought to have an impact on immune system functioning.]